Clinical trial exclusion criteria:
Pregnant or lactating women
Patients with severe organ dysfunction or failure
With severe cardiovascular disease, or mental
Extraliver metastases

Annotated entities:
- Condition: "Pregnant"
- Condition: "lactating"
- Person: "women"
- Qualifier: "severe"
- Condition: "organ dysfunction"
- Condition: "organ failure"
- Condition: "cardiovascular disease"
- Condition: "disease mental"
- Qualifier: "severe"
- Condition: "Extraliver metastases"
- Qualifier: "Extraliver"
- Condition: "metastases"